What is known about potential implication of thyroid hormone receptors in arterial hypertension?

thyroid hormone receptors are implicated in arterial hypertension